56歲男性糖尿病人因胸部不適至急診，初步檢查血中creatinine 2.0 mg/dL、K+ 5.8 mEq/L、Na+  139 mEq/L、 Cl- 116 mEq/L、HCO3- 18 mEq/L、osmolality 290 mOsm/kg‧H2O、尿中creatinine 12 mg/dL、K 9.6 mEq/dL、 osmolality 580 mOsm/kg‧H2O，病人最可能的診斷是：
A. 第二型腎小管酸血症（type 2 renal tubular acidosis）
B. metformin引發酸血症（metformin related acidosis）
C. 低腎素低醛固酮血症（hyporeninemic hypoaldosteronism）
D. 糖尿病酮酸血症（diabetic ketoacidosis）

正確答案：C. 低腎素低醛固酮血症（hyporeninemic hypoaldosteronism）